Dinutuximab is used for treatment of which disease?

Dinutuximab, a monoclonal antibody against disialoganglioside, is used for treatment of high-risk neuroblastoma.